High myopia in the study eye, with a spherical equivalent of >8.00D at screening

The above is a clinical trial exclusion criterion. Annotated with entity spans:
[Condition: High myopia] [Qualifier: in the study eye], with a [Measurement: spherical equivalent] of [Value: >8.00D] [Temporal: at screening]